Clinical trial inclusion criteria:
Healthy
Male
>7 Metabolic Equivalents
Written informed consent
Chronic pain syndrome
Drug abuse
Alcohol abuse
Suspicion of neurologic dysfunction at tested sites
Ongoing treatment with antidepressants
Ongoing treatment with analgesics
Pretreatment with any CYP3A inducers or inhibitors
Known allergy to tested drugs
Elevated eye pressure
Obstructive uropathy
Heart disease
Pulmonary disease
Neurological disease
Psychiatric illness

Annotated entities:
- Condition: "Healthy"
- Person: "Male"
- Value: ">7"
- Measurement: "Metabolic Equivalents"
- Informed_consent: "Written informed consent"
- Condition: "Chronic pain syndrome"
- Condition: "Drug abuse"
- Condition: "Alcohol abuse"
- Mood: "Suspicion"
- Condition: "neurologic dysfunction"
- Qualifier: "tested sites"
- Temporal: "Ongoing"
- Procedure: "treatment"
- Drug: "antidepressants"
- Temporal: "Ongoing"
- Procedure: "treatment"
- Drug: "analgesics"
- Procedure: "Pretreatment"
- Drug: "CYP3A inducers"
- Drug: "CYP3A inhibitors"
- Condition: "allergy"
- Drug: "tested drugs"
- Condition: "Elevated eye pressure"
- Condition: "Obstructive uropathy"
- Condition: "Heart disease"
- Condition: "Pulmonary disease"
- Condition: "Neurological disease"
- Condition: "Psychiatric illness"